Clinical trial inclusion criterion:
Not diagnosed with Type 2 diabetes.

Entity relations:
- Has_negation("Type 2 diabetes", "Not")